下列何者不是診斷川崎氏症（Kawasaki disease）的主要條件？
A. 持續高燒（>38.5℃）5 天
B. 兩側結膜炎
C. 唇裂合併草莓舌
D. 卡介苗（BCG）疤處發生紅腫現象

正確答案：D. 卡介苗（BCG）疤處發生紅腫現象